Clinical trial inclusion criterion:
absence of abnormal findings on X-ray.

Annotated entities:
- Negation: "absence of"
- Condition: "abnormal findings"
- Procedure: "X-ray"